Clinical trial exclusion criterion:
The use of butalbital in any form within 4 weeks of beginning the Preliminary Screening Period (P1) through the end of the participant's study involvement is exclusionary.

Annotated entities:
- Drug: "butalbital"
- Temporal: "within 4 weeks of beginning the Preliminary Screening Period (P1)"